Clinical trial exclusion criterion:
Admission to the intensive care unit for current pulmonary exacerbation in the two weeks prior to Visit 2, unless admission was due to a desensitization protocol

Annotated entities:
- Observation: "Admission to the intensive care unit"
- Visit: "intensive care unit"
- Condition: "pulmonary exacerbation"
- Temporal: "in the two weeks prior to Visit 2"
- Reference_point: "Visit 2"
- Procedure: "desensitization protocol"
- Negation: "unless"